Clinical trial inclusion criteria:
age > 18
written informed consent
SVD defined on echocardiography by an alteration of bioprosthesis leaflets function with a mean transvalvular gradient > 20 mmHg and maximal velocity = 3 m/s and effective orifice area =1.2 cm², and/or an aortic regurgitation more or equal to grade 2 on 4.

Annotated entities:
- Person: "age"
- Value: "> 18"
- Informed_consent: "written informed consent"
- Condition: "SVD"
- Procedure: "echocardiography"
- Condition: "alteration of bioprosthesis leaflets function"
- Measurement: "mean transvalvular gradient"
- Value: "> 20 mmHg"
- Measurement: "maximal velocity"
- Value: "= 3 m/s"
- Measurement: "effective orifice area"
- Value: "=1.2 cm²"
- Condition: "aortic regurgitation"
- Value: "more or equal to 2 on 4"
- Measurement: "grade"